Clinical trial inclusion criterion:
2. Greater than the age of 18

Entity relations:
- Has_value("age", "Greater than 18")